Clinical trial exclusion criterion:
Patients with significant bleeding disorder or liver disorder

Annotated entities:
- Condition: "bleeding disorder"
- Condition: "liver disorder"
- Qualifier: "significant"